¿Cuál de los siguientes virus de vertebrados requiere durante su ciclo de multiplicación de una polimerasa con actividad transcriptasa reversa?
1. Virus del herpes simple de tipo 1.
2. Virus de la viruela.
3. Virus varicela-zóster.
4. Virus de la hepatitis B.
5. Virus Epstein-Barr.

Respuesta correcta: 4. Virus de la hepatitis B.